子宮外孕輸卵管妊娠，胎囊大於 3.5 公分且有胎心跳，病人狀況良好，這時最適合的治療方式為何？
A. 追蹤檢測血中 hCG 濃度
B. 內科療法給與 Methotrexate
C. 外科腹腔鏡手術
D. 剖腹切除外孕側的輸卵管及卵巢

正確答案：C. 外科腹腔鏡手術